Constrictive pericarditis

The above is a clinical trial exclusion criterion. Annotated with entity spans:
[Condition: Constrictive pericarditis]